Clinical trial inclusion criterion:
CMV-positive GBM

Entity relations:
- Has_qualifier("GBM", "CMV-positive")
- AND("CMV-positive", "CMV")